Subjects with excessively thin corneas.

The above is a clinical trial exclusion criterion. Annotated with entity spans:
Subjects with [Condition: excessively thin corneas].